Anatomically narrow ocular angles.

The above is a clinical trial exclusion criterion. Annotated with entity spans:
[Condition: Anatomically narrow ocular angles].